35歲女性，下列何種情況比較有可能得子宮內膜癌？
A. 使用口服避孕藥的性工作者
B. 有多囊性卵巢症及糖尿病的已婚婦女
C. 規則月經的運動選手
D. 裝有子宮內避孕器的婦女

正確答案：B. 有多囊性卵巢症及糖尿病的已婚婦女